Active intake of toxic amounts of alcohol or recreational drugs.

The above is a clinical trial exclusion criterion. Annotated with entity spans:
[Temporal: Active intake] of [Multiplier: toxic amounts] of [Condition: alcohol] or [Condition: recreational drugs].